下列何者生理因素，最不會影響人類神經傳導（nerve conduction）的反應時間？
A. 身高
B. 受檢時的姿勢
C. 年齡
D. 體溫

正確答案：B. 受檢時的姿勢